一位 25 歲男性摩托車騎士與卡車追撞後，因兩側下肢骨折被送至醫院急診室。在急診第一次量測之生命徵象為血壓 80/50 毫米汞柱（mmHg），心跳 120 次/分，呼吸 26 次/分、神智不清。此時，傷患屬於第幾級出血休克，應採何種輸液治療？
A. 屬於第一級出血性休克，可採乳酸林格氏液（lactated Ringer's solution）2 公升靜脈灌注
B. 屬於第三級出血性休克，可採乳酸林格氏液（lactated Ringer's solution）1 公升靜脈灌注
C. 屬於第一級出血性休克，可採 1000 毫升濃縮式紅血球（packed red blood cells）灌注
D. 屬於第二級出血性休克，可採 1000 毫升濃縮式紅血球（packed red blood cells）灌注

正確答案：B. 屬於第三級出血性休克，可採乳酸林格氏液（lactated Ringer's solution）1 公升靜脈灌注